Usted está valorando el recinto donde están recogidos 100 perros abandonados. De los datos procedentes de la observación destacan la situación de hacinamiento de los animales, el ambiente lleno de polvo y el estado de excitación de los animales. Mientras entrevista a uno de los trabajadores, le informa que lleva 6 años trabajando de 7:00 a 13:30 h, dando de comer y beber a los animales y limpiando los habitáculos donde viven. Nunca se ha sentido mal, cree que ningún perro le va a morder y que nada sabe de prevenciones y cuidados que deben mantener mientras trabaja. Con los datos que posee, determina que existe una situación de:
1. Descuido personal.
2. Desempeño infectivo de rol.
3. Disposición para mejorar el autocuidado.
4. Riesgo de infección.
5. Riesgo de contaminación.

Respuesta correcta: 4. Riesgo de infección.